Si el anestesista realiza una anestesia intradural, al anestésico local lo inyecta en:
1. Espacio subaracnoideo.
2. Espacio peridural.
3. Ligamento amarillo.
4. Espacio epidural.

Respuesta correcta: 1. Espacio subaracnoideo.